Clinical trial inclusion criterion:
• Enthesitis (heel) physician-diagnosed (spontaneous pain or tenderness at examination of the site of the insertion of the Achilles tendon or plantar fascia)

Annotated entities:
- Condition: "Enthesitis"
- Qualifier: "heel"
- Condition: "pain"
- Condition: "tenderness"
- Qualifier: "site of the insertion of the Achilles tendon"
- Qualifier: "plantar fascia"